Written informed consent obtained from the subject prior to performing any study specific procedure.

The above is a clinical trial inclusion criterion. Annotated with entity spans:
[Observation: Written informed consent] obtained from the subject [Temporal: prior to performing any study specific procedure].